Singleton pregnancy = 37 weeks gestation

The above is a clinical trial inclusion criterion. Annotated with entity spans:
[Condition: Singleton pregnancy] [Value: = 37 weeks] [Measurement: gestation]